Clinical trial inclusion criterion:
Patients may have received prior definitive radiation therapy or surgery. At least 60 days must have elapsed since completion of definitive radiation therapy or surgery and patient must have only grade 2 or less adverse effects at the time of registration. Enrollment during palliative radiation of = 10 days, or radiation of = 10 days during the duration of the study is allowed.

Entity relations:
- Has_qualifier("radiation therapy", "definitive")
- Has_temporal("radiation therapy", "prior")
- Has_index("At least 60 days must have elapsed since completion of definitive radiation therapy or surgery", "completion of definitive radiation therapy or surgery")
- Has_qualifier("adverse effects", "grade 2 or less")
- Has_temporal("adverse effects", "at the time of registration")
- Has_temporal("radiation therapy", "At least 60 days must have elapsed since completion of definitive radiation therapy or surgery")
- OR("radiation therapy", "surgery")
- OR("radiation therapy", "surgery")